聲音由空氣傳到人體內耳內淋巴液，依聲學原理，聲音減損了幾分貝？
A. 5
B. 10
C. 20
D. 30

正確答案：D. 30